Clinical trial inclusion criterion:
Have stable COPD medication within 4 weeks prior to Visit 1 (no new medication added and no dosage changes in medication).

Entity relations:
- Has_temporal("COPD medication", "within 4 weeks prior to Visit 1")
- Has_qualifier("COPD medication", "stable")